Clinical trial inclusion criterion:
willingness to receive rescue therapy

Annotated entities:
- Mood: "willingness"
- Procedure: "rescue therapy"